Medical conditions complicating pregnancy.

The above is a clinical trial exclusion criterion. Annotated with entity spans:
[Condition: Medical conditions] [Qualifier: complicating pregnancy].